Clinical trial inclusion criterion:
Age equal or greater than 70 years

Annotated entities:
- Person: "Age"
- Value: "equal or greater than 70 years"